Clinical trial exclusion criterion:
Atrioventricular block II and III in patients without pacemaker

Entity relations:
- Has_negation("pacemaker", "without")
- OR("Atrioventricular block II", "Atrioventricular block III")